Clinical trial exclusion criterion:
Eye disease treated with topical steroids.

Entity relations:
- AND("Eye disease", "topical steroids")